下列有關 Salmonella 的敘述，何者錯誤？
A. 人類是 Salmonella typhi 的唯一宿主
B. 許多動物是 nontyphoidal Salmonellosis 的宿主
C. 以第一代 cephalosporin 治療
D. 以第三代 cephalosporin 治療

正確答案：C. 以第一代 cephalosporin 治療